¿Qué tipo de análisis de evaluación económica en salud compara los costes de los resultados de diferentes intervenciones sanitarias medidos en años de vida ajustados por calidad (AVAC)?
1. Análisis de minimización de los costes.
2. Análisis de coste efectividad.
3. Análisis de coste utilidad.
4. Análisis de coste beneficio.
5. Análisis del coste de la salud.

Respuesta correcta: 3. Análisis de coste utilidad.